HIV (+)

The above is a clinical trial exclusion criterion. Annotated with entity spans:
[Condition: HIV (+)]